Clinical trial exclusion criterion:
Psychiatric disorder

Annotated entities:
- Condition: "Psychiatric disorder"